吸入性麻醉劑halothane合併肌肉鬆弛劑succinylcholine，可能引起惡性高熱症（malignant hyperthermia），下列何種藥物可緩解？
A. dantrolene
B. isoflurane
C. diazepam
D. theophylline

正確答案：A. dantrolene